4. Baseline ejection fraction ≤ 50% as assessed by echocardiogram or MUGA.

The above is a clinical trial exclusion criterion. Annotated with entity spans:
[Parsing_Error: 4.] [Temporal: Baseline] [Measurement: ejection fraction] [Value: ≤ 50%] as assessed by [Procedure: echocardiogram] or [Procedure: MUGA].